Clinical trial inclusion criterion:
second trimester abortion

Annotated entities:
- Qualifier: "second trimester"
- Condition: "abortion"